Clinical trial exclusion criterion:
7. Subject underwent cardiac surgery or cerebrovascular events within the previous six months;

Entity relations:
- Has_temporal("cardiac surgery", "within the previous six months")
- OR("cardiac surgery", "cerebrovascular events")